¿En qué trastorno de personalidad puede el individuo tener sospechas infundadas y recurrentes sobre la fidelidad de la pareja, así como tener dudas de la lealtad u honradez de los amigos o conocidos?:
1. En el trastorno de personalidad celotípico.
2. En el trastorno de personalidad delirante.
3. En el trastorno de personalidad dependiente.
4. En el trastorno de personalidad paranoide.
5. En el trastorno de personalidad narcisista.

Respuesta correcta: 4. En el trastorno de personalidad paranoide.